Severe concomitant disease with life expectancy below 12 months;

The above is a clinical trial exclusion criterion. Annotated with entity spans:
[Qualifier: Severe] [Temporal: concomitant] [Condition: disease] with [Observation: life expectancy] [Value: below 12 months];